Clinical trial exclusion criterion:
Systolic BP more than 160mmHg

Annotated entities:
- Measurement: "Systolic BP"
- Value: "more than 160mmHg"